對於尿酸結石的治療，下列那一項敘述是正確的？
A. 多吃含嘌呤（purine）食物
B. 可服用 allopurinol 藥物
C. 不可服用碳酸鈉（sodium bicarbonate）藥物
D. 少喝水

正確答案：B. 可服用 allopurinol 藥物